Clinical trial exclusion criterion:
Pregnant women.

Annotated entities:
- Condition: "Pregnant"
- Person: "women"